Clinical trial exclusion criterion:
(i) influenza vaccination, which may be received at least 2 weeks before study vaccines.

Entity relations:
- Has_index("at least 2 weeks before study vaccines", "study vaccines")
- Has_temporal("influenza vaccination", "at least 2 weeks before study vaccines")